Has had a malignancy within 5 years before screening (exceptions are squamous and basal cell carcinomas of the skin and carcinoma in situ of cervix that has been surgically cured)

The above is a clinical trial exclusion criterion. Annotated with entity spans:
Has had a [Condition: malignancy] [Temporal: within 5 years before screening] ([Negation: exceptions] are [Condition: squamous] and [Condition: basal cell carcinomas of the skin] and [Condition: carcinoma in situ] of [Qualifier: cervix] that has been [Qualifier: surgically cured])